Clinical trial exclusion criterion:
Active vaginal bleeding

Annotated entities:
- Condition: "Active vaginal bleeding"